How many times is CLAST faster than BLAST?

was capable of identifying sequence similarities ~80.8 times faster than blast and 9.6 times faster than blat .